Clinical trial exclusion criterion:
Invasion of central nervous system;

Annotated entities:
- Condition: "Invasion"
- Qualifier: "central nervous system"